一位 50 歲男性的左耳前近下頷骨上方，有一個界限分明、不會疼痛的腫塊。2 年前他已發現這個腫塊存在，他覺得腫塊慢慢變大，目前約有 3 公分大而就醫。除此之外，他並未有其他的症狀。此病人的腫塊最可能是：
A. 腺樣囊狀癌（Adenoid cystic carcinoma）
B. 惡性淋巴瘤（Malignant lymphoma）
C. 多形性腺瘤（Pleomorphic adenoma）
D. 鱗狀細胞癌（Squamous cell carcinoma）

正確答案：C. 多形性腺瘤（Pleomorphic adenoma）